Clinical trial exclusion criteria:
Sensitivity to pilocarpine
Secondary Sjögren's syndrome;
Type II diabetes mellitus;
AIDS;
pregnant or lactating women;
Glaucoma;
Uncontrolled asthma;
Chronic obstructive pulmonary disease;
Renal diseases;
Severe cardiovascular diseases;
Gastrointestinal disorders;
Hepatic insufficiency.

Annotated entities:
- Condition: "Sensitivity"
- Drug: "pilocarpine"
- Condition: "Sjögren's syndrome"
- Qualifier: "Secondary"
- Condition: "Type II diabetes mellitus"
- Condition: "AIDS"
- Pregnancy_considerations: "pregnant or lactating women"
- Condition: "Glaucoma"
- Condition: "asthma"
- Qualifier: "Uncontrolled"
- Condition: "Chronic obstructive pulmonary disease"
- Condition: "Renal diseases"
- Condition: "cardiovascular diseases"
- Qualifier: "Severe"
- Condition: "Gastrointestinal disorders"
- Condition: "Hepatic insufficiency"